Femoral sheath (artery)

The above is a clinical trial exclusion criterion. Annotated with entity spans:
[Condition: Femoral sheath (artery)]